Clinical trial inclusion criterion:
Screening Hamilton Depression Rating Scale (HAMD) = 18; and Baseline HAMD = 15.

Annotated entities:
- Measurement: "Screening Hamilton Depression Rating Scale"
- Measurement: "HAMD"
- Value: "= 18"
- Measurement: "HAMD"
- Qualifier: "Baseline"
- Value: "= 15"